下列有關類鼻疽（melioidosis）之敘述，何者錯誤？
A. 致病菌為Burkholderia pseudomallei
B. 最常見臨床表現為急性社區型肺炎
C. 最佳治療選擇為ceftazidime或carbapenems等後線抗生素
D. 療程約4週內，復發率低

正確答案：D. 療程約4週內，復發率低